Clinical trial exclusion criterion:
RELIANCE 4-Front Study outcome (i.e. involve medications that could affect the heart rate of the subject);

Annotated entities:
- Non-query-able: "RELIANCE 4-Front Study outcome (i.e. involve medications that could affect the heart rate of the subject);"
- Context_Error: "RELIANCE 4-Front Study outcome (i.e. involve medications that could affect the heart rate of the subject);"